下列何者能刺激血管收縮？
A. 心房利鈉胜肽（atrial natriuretic peptide）
B. 前列環素（prostacyclin）
C. 一氧化氮（nitric oxide）
D. 內皮素-1（endothelin-1）

正確答案：D. 內皮素-1（endothelin-1）